Clinical trial exclusion criterion:
specific brain related disorder (such as tuberous sclerosis)

Entity relations:
- Has_qualifier("disorder", "brain")
- Subsumes("disorder", "tuberous sclerosis")